8. Currently enrolled in an investigational drug or device study or have used an investigational drug or device within 30 days prior to Visit 1.

The above is a clinical trial exclusion criterion. Annotated with entity spans:
[Parsing_Error: 8.] Currently enrolled in an [Drug: investigational drug] or device study or have used an [Drug: investigational drug] or device [Temporal: within 30 days prior to Visit 1].